由維生素 D3（vitamin D3）轉變成為 25-羥基維生素 D3（25-OH-vitamin D3），主要發生於：
A. 肝臟
B. 腎臟
C. 肺臟
D. 甲狀腺

正確答案：A. 肝臟